allergy to constituents in Xenbilox (capsules with chenodeoxycholic acid)

The above is a clinical trial exclusion criterion. Annotated with entity spans:
[Condition: allergy] to [Drug: constituents in Xenbilox] (capsules with [Drug: chenodeoxycholic acid])